¿Cuál de las siguientes regiones del sistema nervioso central contiene zonas donde no existe barrera hematoencefálica?:
1. Hipotálamo.
2. Tálamo.
3. Bulbo raquídeo.
4. Cerebelo.

Respuesta correcta: 3. Bulbo raquídeo.